下列有關石棉塵肺症（asbestosis）的敘述，何者錯誤？
A. 閃石石棉（amphibole）較溫石棉（chrysotile）易引起間皮瘤
B. 病人罹患肺癌的機率比一般人高
C. 病理可見石棉小體（asbestos body），為石棉纖維經中性白血球吞噬所產生
D. 接觸石棉是造成間皮瘤最主要的原因

正確答案：C. 病理可見石棉小體（asbestos body），為石棉纖維經中性白血球吞噬所產生